Las endonucleasas de restricción de tipo II escinden la molécula de ADN:
1. Dentro de su secuencia de reconocimiento.
2. Aleatoriamente.
3. Fuera de la secuencia de reconocimiento.
4. En el extremo 5´.
5. En el extremo 3´.

Respuesta correcta: 1. Dentro de su secuencia de reconocimiento.